Clinical trial exclusion criterion:
A terminal illness

Annotated entities:
- Condition: "terminal illness"